Clinical trial inclusion criterion:
Moderate to severe CD define as HBI score > 4.

Annotated entities:
- Qualifier: "Moderate"
- Qualifier: "severe"
- Condition: "CD"
- Measurement: "HBI score"
- Value: "> 4"